下列有關神經細胞尼氏體（Nissl's body）的敘述，何者正確？
A. 由高爾基氏體和核糖體所構成
B. 出現於細胞體和樹突內，但軸突內則無
C. 只能在電子顯微鏡下觀察，光學鏡下無法看到
D. 通常位在突觸小泡內

正確答案：B. 出現於細胞體和樹突內，但軸突內則無